Clinical trial inclusion criterion:
Subjects = 19 or = 75 years of age

Annotated entities:
- Value: "= 19 or = 75 years"
- Person: "age"